Clinical trial exclusion criterion:
Inability to exercise or undertake a MRP

Entity relations:
- Has_negation("exercise", "Inability")
- OR("exercise", "MRP")